Clinical trial inclusion criterion:
Patients experiencing an average weekly pain intensity score greater than 4 on a 11 points NRS

Entity relations:
- Has_value("average weekly pain intensity score on a 11 points NRS", "greater than 4")